Current or past history of psychosis

The above is a clinical trial exclusion criterion. Annotated with entity spans:
[Temporal: Current] or [Temporal: past] [Temporal: history] of [Condition: psychosis]